Niño de 8 años que acude a Urgencias porque le ha mordido un niño mientras jugaban, hace unas 6 horas. Presenta una leve herida incisocontusa en el antebrazo derecho. Además de plantearse otras medidas, ¿qué antimicrobiano pautaría usted?
1. Ciprofloxacino, pensando en que la flora oral está compuesta por flora mixta con predominio de flora anaerobia.
2. Aztreonam, pensando en que la flora oral está compuesta por flora mixta con predominio de enterobacterias.
3. Amoxicilina-clavulánico, pensando en que la flora oral está compuesta por flora mixta con predominio de flora gram positiva y anaerobia.
4. Fluconazol, pensando en que la flora oral está compuesta por flora mixta con predominio de las levaduras como Candida albicans.
5. Metronidazol, pensando en que la flora oral está compuesta por flora mixta con predominio de flora anaerobia.

Respuesta correcta: 3. Amoxicilina-clavulánico, pensando en que la flora oral está compuesta por flora mixta con predominio de flora gram positiva y anaerobia.